Clinical trial exclusion criterion:
Pregnant or lactating women

Annotated entities:
- Condition: "Pregnant"
- Condition: "lactating"
- Person: "women"